Felipe, que habitualmente acude a su consulta en el centro de salud, presenta actualmente un brote psicótico en el que el deseo de ingerir agua está condicionado por su ideación delirante de perjuicio, dando lugar a conductas de evitación. Indique, de acuerdo con el modelo de Dorothea Orem, qué elemento está disminuido para que se produzca un déficit en el requisito de mantenimiento de un aporte suficiente de agua:
1. Demanda de Autocuidado Terapéutico.
2. Agencia de Autocuidado.
3. Factores Básicos Condicionantes.
4. Capacidad de Cuidado Dependiente.

Respuesta correcta: 2. Agencia de Autocuidado.